Lack of understanding of the study

The above is a clinical trial exclusion criterion. Annotated with entity spans:
[Observation: Lack of understanding of the study]